Clinical trial exclusion criterion:
Person who is not wearing prosthesis 8hours/day on average.

Annotated entities:
- Negation: "not"
- Device: "prosthesis"
- Multiplier: "8hours/day"